Fasting plasma glucose between 200-300 mg/dl (A1C level between 7% and 10%).

The above is a clinical trial inclusion criterion. Annotated with entity spans:
[Measurement: Fasting plasma glucose] [Value: between 200-300 mg/dl] ([Measurement: A1C level] [Value: between 7% and 10%]).